¿Cuál de las siguientes filariosis se diagnostica por hallazgo de microfilarias en la piel:
1. Loa loa.
2. Wuchereria bancrofti.
3. Brugia malayi
4. Mansonella perstans.
5. Onchocerca volvulus.

Respuesta correcta: 5. Onchocerca volvulus.